與細胞膜局部電位（local potential）有關的描述，下列何者錯誤？
A. 局部電位與細胞膜之組成有關
B. 僅神經細胞才具有局部電位
C. 局部電位決定動作電位（action potential）發生（initiation）與傳遞（propagation）之性質
D. 局部電位無不反應期（refractory period）

正確答案：B. 僅神經細胞才具有局部電位